Which databases exist for experimentally determined topologies of α-helical transmembrane proteins ?

ExTopoDB and TMPDB.